La holoenzima RNA polimerasa procariótica:
1. No se inhibe por rifampicina.
2. Requiere un cebador para iniciar la transcripción.
3. Participa en el proceso de replicación del DNA.
4. Requiere secuencias específicas para iniciar la transcripción.

Respuesta correcta: 4. Requiere secuencias específicas para iniciar la transcripción.